何種物質對平流層中臭氧的濃度影響最大？
A. 碳酸鹽化物
B. 硫酸鹽化物
C. 氟氯碳化物
D. 過氧化物

正確答案：C. 氟氯碳化物